關於子宮腺肌症（adenomyosis）之敘述，下列何者錯誤？
A. 子宮內膜腺體組織直接侵入子宮的肌層
B. 子宮腺肌症的症狀主要是痛經與月經過多
C. 使用促排卵藥治療時，子宮腺肌症會萎縮變小
D. 以aromatase inhibitors 治療可以使之縮小

正確答案：C. 使用促排卵藥治療時，子宮腺肌症會萎縮變小